Clinical trial exclusion criterion:
Subject who showed medically significant adverse events or intolerance with aripiprazole during screening period or as prior experiences.

Annotated entities:
- Condition: "intolerance"
- Condition: "adverse events"
- Qualifier: "medically significant"
- Drug: "aripiprazole"
- Temporal: "during screening period"
- Temporal: "as prior experiences"